¿Cuál de las siguientes afirmaciones acerca de la técnica de las imágenes emotivas es FALSA?
1. Es una variante de la desensibilización sistemática.
2. Fue desarrollada para tratar las fobias de niños pequeños o con dificultades para relajarse.
3. Es un programa multicomponente para el tratamiento de las fobias infantiles.
4. Se suele inducir una respuesta inhibitoria a la ansiedad diferente a la relajación.
5. Puede utilizarse para el tratamiento de los miedos médicos.

Respuesta correcta: 3. Es un programa multicomponente para el tratamiento de las fobias infantiles.